Heart disease or heart rhythm disorder or taking anti-arrhythmic drugs

The above is a clinical trial exclusion criterion. Annotated with entity spans:
[Condition: Heart disease] or [Condition: heart rhythm disorder] or taking [Drug: anti-arrhythmic drugs]